11. Willing to answer acceptability and adherence questionnaires throughout the study

The above is a clinical trial inclusion criterion. Annotated with entity spans:
11. [Post-eligibility: Willing to answer acceptability and adherence questionnaires throughout the study]